下列藥物何者屬於 Alkylating agent？
A. Thioguanine
B. Busulfan
C. Bleomycin
D. Vincristine

正確答案：B. Busulfan